人類眼外肌中，下列何條眼肌最長？
A. 上直肌（superior rectus muscle）
B. 上斜肌（superior oblique muscle）
C. 下直肌（inferior rectus muscle）
D. 下斜肌（inferior oblique muscle）

正確答案：B. 上斜肌（superior oblique muscle）